3. History of oxygen dependence;

The above is a clinical trial exclusion criterion. Annotated with entity spans:
[Parsing_Error: 3.] [Temporal: History] of [Condition: oxygen dependence];